Clinical trial exclusion criterion:
Subjects who have initiated psychotherapy in the last 4 months prior to the first visit.

Annotated entities:
- Procedure: "psychotherapy"
- Temporal: "in the last 4 months prior to the first visit"
- Reference_point: "first visit"